Aleglitazar is agonist of which receptor?

Aleglitazar is a balanced peroxisome proliferator-activated receptor-α/γ agonist.